¿Qué comparten todas las especies de los géneros Mycobacterium y Nocardia?
1. Presentar ácidos micólicos en su pared.
2. Ser patógenas de animales.
3. Formar hifas bien desarrolladas.
4. Formar endosporas.

Respuesta correcta: 1. Presentar ácidos micólicos en su pared.